下列何者不是評估胎兒肺部成熟的檢驗？
A. K-B test（Kleihauer-Betke test）
B. L/S Ratio（Lecithin/Sphingomyelin）
C. PG（Phosphatidylglycerol）
D. Shake test

正確答案：A. K-B test（Kleihauer-Betke test）